Clinical trial exclusion criterion:
Women only: Cannot be pregnant or nursing at baseline or plan to become pregnant during the course of the study

Entity relations:
- AND("Women", "Cannot be pregnant or nursing at baseline or plan to become pregnant during the course of the study")